Clinical trial inclusion criteria:
Scheduled for bilateral varus rotational osteotomy (VRO) with or without associated soft tissue and osseous procedures

Annotated entities:
- Qualifier: "bilateral"
- Mood: "Scheduled for"
- Procedure: "varus rotational osteotomy"
- Procedure: "VRO"
- Procedure: "osseous procedures"
- Procedure: "procedures soft tissue"